Clinical trial inclusion criterion:
signed written informed consent and willingness to comply with treatment and follow-up procedures

Annotated entities:
- Informed_consent: "signed written informed consent and willingness to comply with treatment and follow-up procedures"